All subjects are willing to complete the 6-weeks period clinical trial.

The above is a clinical trial inclusion criterion. Annotated with entity spans:
[Post-eligibility: All subjects are willing to complete the 6-weeks period clinical trial].